Previous treatment by chemoembolization, radiofrequency less than 3 months before radioembolization

The above is a clinical trial exclusion criterion. Annotated with entity spans:
Previous treatment by [Procedure: chemoembolization], [Procedure: radiofrequency] [Temporal: less than 3 months before radioembolization]